一位 6 歲男孩不自主的臉部肌肉抽動，合併清喉嚨或無意義的重複聲音，症狀在病患緊張時會更明顯，睡覺時會消失。此男孩最可能為下列何種疾病？
A. 妥瑞氏症（Tourette's syndrome）
B. 中風（stroke）
C. 癲癇（epilepsy）
D. 錐體外系反應（extrapyramidal symptoms）

正確答案：A. 妥瑞氏症（Tourette's syndrome）